42 歲男性因高血鈣入院接受副甲狀腺瘤切除手術，術後出現低血鈣的現象，其最主要原因可能為下 列何者？
A. 因尿中鈣質排放量遽增導致鈣質流失
B. 因腸胃道鈣質排放增加導致鈣質流失
C. 鈣質沉積於骨中增加，導致血鈣急遽下降
D. 因手術中誘發的 stress 導致的激素變化所致

正確答案：C. 鈣質沉積於骨中增加，導致血鈣急遽下降